Clinical trial inclusion criterion:
Essential hypertension who had never received angiotensin II receptor antagonists and calcium channel blockers

Annotated entities:
- Condition: "Essential hypertension"
- Drug: "angiotensin II receptor antagonists"
- Drug: "calcium channel blockers"
- Negation: "never"